Clinical trial exclusion criterion:
Hypercoagulable state

Annotated entities:
- Condition: "Hypercoagulable state"